Clinical trial exclusion criterion:
Current use of tobacco products;

Entity relations:
- Has_temporal("use of tobacco products", "Current")